Clinical trial inclusion criterion:
weight over 40 kg

Entity relations:
- Has_value("weight", "over 40 kg")